Clinical trial exclusion criterion:
history of neck surgery or radiotherapy;

Annotated entities:
- Temporal: "history"
- Procedure: "neck surgery"
- Procedure: "radiotherapy"